Clinical trial exclusion criterion:
Platelets < 75 x 109 cells/L.

Entity relations:
- Has_value("Platelets", "< 75 x 109 cells/L")